Glycemic control: HbA1c = 10.0%

The above is a clinical trial inclusion criterion. Annotated with entity spans:
Glycemic control: [Measurement: HbA1c] [Value: = 10.0%]